Clinical trial exclusion criterion:
Immunosuppressive therapy, including cytotoxic agents within 14 days of first dose of 852A (nitrosoureas within 30 days of first dose)

Entity relations:
- Subsumes("Immunosuppressive therapy", "cytotoxic agents")
- AND("within 14 days of first dose", "852A")
- Has_temporal("Immunosuppressive therapy", "within 14 days of first dose")
- Has_temporal("nitrosoureas", "within 30 days of first dose")
- OR("Immunosuppressive therapy", "nitrosoureas")